Clinical trial exclusion criterion:
Preoperative renal failure requiring dialysis

Annotated entities:
- Temporal: "Preoperative"
- Condition: "renal failure"
- Mood: "requiring"
- Procedure: "dialysis"